RLS symptoms for at least 4 of 7 consecutive evenings/nights during the screening period.

The above is a clinical trial inclusion criterion. Annotated with entity spans:
[Condition: RLS symptoms] for [Multiplier: at least 4 of 7 consecutive evenings/nights] during the screening period.